Clinical trial inclusion criterion:
Able to complete full ankle flexion-extension bilaterally

Annotated entities:
- Mood: "Able to"
- Procedure: "complete full ankle flexion-extension bilaterally"